Clinical trial exclusion criterion:
Alcoholic liver disease

Annotated entities:
- Condition: "Alcoholic liver disease"